Clinical trial exclusion criterion:
Serious medical comorbidities

Annotated entities:
- Condition: "medical comorbidities"
- Qualifier: "Serious"